Clinical trial exclusion criterion:
Known or suspected hepatic, symptomatic biliary disease (this includes moderate to severe chronic hepatic impairment)

Annotated entities:
- Condition: "biliary disease"
- Condition: "hepatic disease"
- Qualifier: "moderate"
- Qualifier: "severe"
- Condition: "chronic hepatic impairment"